¿Qué es el gasto cardíaco?
1. El volumen de sangre que sale del corazón por unidad de tiempo (ml/min o l/min).
2. El latido cardíaco completo constituido por la contracción (sístole) y la relajación (diástole) en ambas aurículas y en ambos ventrículos medido en tiempo (seg).
3. La sangre que queda en el corazón cuando el gradiente de presión determina la distensión de las fibras cardíacas.
4. El gradiente de potencia de la contracción, también llamado contractilidad.
5. El volumen ventricular que permanece constante.

Respuesta correcta: 1. El volumen de sangre que sale del corazón por unidad de tiempo (ml/min o l/min).